Clinical trial inclusion criterion:
Patient is aged greater than or equal to 40 and less than or equal to 89 years of age

Annotated entities:
- Value: "greater than or equal to 40"
- Person: "aged"
- Value: "less than or equal to 89 years"